Clinical trial exclusion criterion:
Pregnant, nursing, or not using effective methods of birth control

Entity relations:
- Has_qualifier("birth control", "effective methods")
- Has_negation("birth control", "not")
- OR("Pregnant", "nursing", "birth control")